現在出現一個 25 歲腦死的潛在性器官捐贈者，下列那一個病患需要心肺移植（heart-lung  transplantation）？
A. 末期肺氣腫（end-stage emphysema）
B. 缺血性心臟病（ischemic heart disease）
C. 原發性肺動脈高壓（primary pulmonary hypertension）
D. 原發性心肌症合併次發性肺動脈高壓

正確答案：D. 原發性心肌症合併次發性肺動脈高壓